Claustrophobia, or the inability to lie still in a confined space

The above is a clinical trial exclusion criterion. Annotated with entity spans:
[Condition: Claustrophobia], or the [Observation: inability to lie still in a confined space]